Infection at the site of block placement

The above is a clinical trial exclusion criterion. Annotated with entity spans:
[Condition: Infection] at the [Qualifier: site of block placement]